Clinical trial exclusion criterion:
History of neurological injury: head trauma, poorly-controlled seizure disorder (seizure within the preceding six months), stroke, prior neurosurgery, or under the care of a neurologist or neurosurgeon as determined by interview

Entity relations:
- Has_temporal("neurological injury", "History")
- Has_temporal("seizure", "within the preceding six months")
- Has_qualifier("seizure disorder", "poorly-controlled")
- AND("poorly-controlled", "seizure")
- Has_temporal("neurosurgery", "prior")
- Subsumes("neurological injury", "head trauma")
- OR("head trauma", "neurosurgery", "seizure disorder", "under the care of a neurosurgeon", "under the care of a neurologist", "stroke")